Clinical trial exclusion criterion:
Presence of positive test results for hepatitis B virus (HBV), hepatitis B surface antigen (HBsAg), or hepatitis C (HCV) antibody.

Annotated entities:
- Measurement: "hepatitis B virus (HBV)"
- Measurement: "hepatitis B surface antigen (HBsAg)"
- Measurement: "hepatitis C (HCV) antibody"
- Value: "positive"